下列有關於 primary aldosteronism 之敘述，何者錯誤？
A. 低血鉀是此疾病的一明顯變化
B. 血漿中 aldosterone 的濃度一般會升高
C. 血漿內的 renin 活性會明顯的升高
D. 主要的病源為腎上腺腫瘤或兩側腎上腺增生

正確答案：C. 血漿內的 renin 活性會明顯的升高